2. Available for all visits and consent to follow all procedures scheduled for the study

The above is a clinical trial inclusion criterion. Annotated with entity spans:
2. [Post-eligibility: Available for all visits and consent to follow all procedures scheduled for the study]